一位 20 歲男性患者，因氣喘急性發作後有持續性胸骨下胸痛之情形，身體檢查發現肺部聽診兩側有吐氣時之喘鳴聲，觸診時可發現胸前有輕度皮下氣腫之情形。患者最可能有下列何種情況？
A. 左側氣胸
B. 縱膈腔氣腫（pneumomediastinum）
C. 狹心症
D. 肋膜腔積水

正確答案：B. 縱膈腔氣腫（pneumomediastinum）